El uso de cambios de entonación y énfasis para añadir significado al habla se denomina:
1. Lexitimia.
2. Tonalidad.
3. Ritmicidad.
4. Melodía.
5. Prosodia.

Respuesta correcta: 5. Prosodia.